Clinical trial exclusion criterion:
major fetal abnormalities

Entity relations:
- Has_qualifier("fetal abnormalities", "major")